Clinical trial inclusion criterion:
clinical or pathological diagnosis of hepatocellular carcinoma (HCC) in previously untreated patients;

Entity relations:
- Subsumes("hepatocellular carcinoma", "HCC")
- Has_qualifier("hepatocellular carcinoma", "clinical or pathological diagnosis")
- Has_qualifier("hepatocellular carcinoma", "untreated")